Clinical trial exclusion criterion:
ASA classification >= IV.

Annotated entities:
- Measurement: "ASA classification"
- Value: ">= IV"